根據Curreri formula，一個50公斤的病人，燒傷面積達70﹪體表面積，一天所需的卡洛里（calorie）約多少大卡（Kcal）？
A. 3,050
B. 3,650
C. 4,050
D. 4,550

正確答案：C. 4,050